30歲之男性病人，因有突發性左側胸痛，呼吸困難而至急診處就醫，觸診（palpation）時發現左下肺野觸覺震顫（tactile fremitus）減少，敲診時為hyper-resonant，聽診時呼吸音減少，最可能診斷為下列何者？
A. 左側肋膜腔積水
B. 左側氣胸
C. 肺氣腫
D. 左下肺葉肺炎

正確答案：B. 左側氣胸